Clinical trial exclusion criterion:
Known active infection, CRP>20 mg/L, clinically significant bleeding, active malignancy.

Entity relations:
- Has_value("CRP", ">20 mg/L")
- Has_qualifier("malignancy", "active")
- Has_qualifier("bleeding", "clinically significant")
- AND("active infection", "CRP")
- OR("active infection", "bleeding", "malignancy")